Newly dignosised type 2 diabetes according to WHO criteria.glycated hemoglobin (HbA1c) was more than 10%;

The above is a clinical trial inclusion criterion. Annotated with entity spans:
[Temporal: Newly dignosised] [Condition: type 2 diabetes] according to [Qualifier: WHO criteria].[Measurement: glycated hemoglobin (HbA1c)] was [Value: more than 10%];